Clinical trial inclusion criteria:
20-70 yrs of age
ASA(American Society of Anesthesiologists) physical status class I or II
Scheduled for gynecological laparoscopic surgery

Annotated entities:
- Person: "age"
- Value: "20-70 yrs"
- Measurement: "ASA physical status class"
- Measurement: "American Society of Anesthesiologists"
- Value: "I or II"
- Qualifier: "gynecological"
- Procedure: "laparoscopic surgery"
- Mood: "Scheduled"